Clinical trial inclusion criterion:
Men and women patients, with age ranging 40-80.

Entity relations:
- Has_value("age", "ranging 40-80")
- OR("Men", "women")